Clinical trial exclusion criterion:
patient with a history of hypersensitivity to colistin

Entity relations:
- AND("hypersensitivity", "colistin")
- Has_temporal("hypersensitivity", "history of")